Clinical trial inclusion criterion:
Adult (= 18 years old) subjects with chronic genotype 1 HCV and NCI with a GDS greater than or equal to 0.5 (n=60).

Annotated entities:
- Person: "Adult"
- Value: "= 18 years old"
- Person: "old"
- Qualifier: "genotype 1"
- Temporal: "chronic"
- Condition: "HCV"
- Condition: "NCI"
- Measurement: "GDS"
- Value: "greater than or equal to 0.5"